Clinical trial exclusion criterion:
Drowning

Annotated entities:
- Condition: "Drowning"